Clinical trial exclusion criterion:
intraocular pressure higher than 25 mmHg, or glaucoma

Annotated entities:
- Measurement: "intraocular pressure"
- Value: "higher than 25 mmHg"
- Condition: "glaucoma"